Received electroconvulsive therapy in the past 6 months or during the current depressive episode.

The above is a clinical trial exclusion criterion. Annotated with entity spans:
Received [Procedure: electroconvulsive therapy] [Temporal: in the past 6 months] or [Temporal: during the current depressive episode].